Clinical trial exclusion criterion:
Clinically significant delusions for which either 1) the frequency of delusions as assessed by the NPI is 'Very frequently', or 2) the frequency of delusions as assessed by the NPI is 'Frequently' AND the severity of the delusions as assessed by the NPI is 'Moderate', or 'Marked'

Entity relations:
- AND("frequency of delusions", "delusions")
- Has_value("NPI", "Very frequently")
- AND("frequency of delusions", "NPI")
- Has_qualifier("delusions", "Clinically significant")
- AND("severity of the delusions", "delusions")
- Has_value("NPI", "Moderate")
- Has_value("NPI", "Frequently")
- AND("frequency of delusions", "NPI")
- AND("severity of the delusions", "NPI")
- Has_multiplier("delusions", "frequency of delusions")
- AND("delusions", "delusions")
- OR("Moderate", "Marked")
- OR("frequency of delusions", "frequency of delusions", "severity of the delusions")